Meet at least 3 of 5 National Cholesterol Education Adult Treatment Panel III

The above is a clinical trial inclusion criterion. Annotated with entity spans:
Meet [Value: at least 3 of 5] [Measurement: National Cholesterol Education Adult Treatment Panel III]